淋巴結中那一種細胞可以呈現抗原抗體複合物（immune complexes）給 B 細胞，同時也可以長久地保存抗原？
A. 邊緣區域之巨噬細胞（marginal zone macrophages）
B. 髓質區域之巨噬細胞（medullary macrophages）
C. 囊泡樹狀突出細胞（follicular dendritic cells）
D. T 細胞區域之樹狀突出細胞（dendritic cells in T cell areas）

正確答案：C. 囊泡樹狀突出細胞（follicular dendritic cells）